What is NTI, Nerve Tissue Contrast Index

The Nerve Tissue Index NTI is a ratio of average brightness levels of surrounding tissue and the median nerve, both calculated on the basis of a ultrasound image.